Clinical trial inclusion criterion:
treated with rituximab-based immunochemotherapy

Entity relations:
- multi("rituximab-based", "rituximab")
- Has_qualifier("immunochemotherapy", "rituximab-based")